Clinical trial exclusion criterion:
Active drug or alcohol use or dependence that would interfere with adherence to study requirements

Entity relations:
- Has_temporal("drug dependence", "Active")
- Has_qualifier("drug dependence", "would interfere with adherence to study requirements")
- OR("drug dependence", "alcohol dependence", "alcohol use", "use")